other disorders that may affect balance or locomotion;

The above is a clinical trial exclusion criterion. Annotated with entity spans:
other [Condition: disorders that may affect balance or locomotion];